Female subjects of child bearing potential must be willing to ensure that they or their partner use effective contraception during the study and for 6 months thereafter OR

The above is a clinical trial inclusion criterion. Annotated with entity spans:
[Pregnancy_considerations: Female subjects of child bearing potential must be willing to ensure that they or their partner use effective contraception during the study and for 6 months thereafter OR]